Referred for surgery for open reduction and internal fixation for ankle fracture

The above is a clinical trial inclusion criterion. Annotated with entity spans:
Referred for [Procedure: surgery] for [Procedure: open reduction and internal fixation] for [Condition: ankle fracture]